Clinical trial exclusion criterion:
history of psychiatric illness

Entity relations:
- Has_temporal("psychiatric illness", "history")